有症狀的膽石症（symptomatic gallstones），其治療方法以下列何者為最好的選擇？
A. 保守性治療（medical treatment）
B. 超音波碎石術（ultrasonic lithotripsy）
C. 腹腔鏡膽囊切除術（laparoscopic cholecystectomy）
D. 經皮穿肝膽囊引流術（percutaneous transhepatic cholecystostomy）

正確答案：C. 腹腔鏡膽囊切除術（laparoscopic cholecystectomy）